F4 or decompensated cirrhotic patients

The above is a clinical trial exclusion criterion. Annotated with entity spans:
[Observation: F4] or [Condition: decompensated cirrhotic] patients